Clinical trial exclusion criterion:
Active syphilis or treatment for syphilis within 90 days prior to study entry. NOTE: Active syphilis is defined as four-fold increase in serum rapid plasma reagin (RPR) or venereal disease research laboratory (VDRL) tests in an individual with past syphilis, or newly reactive serum RPR or VDRL with a reactive confirmatory test (enzyme immunoassays [EIA] or chemiluminescent assay [CIA], T. pallidum particle agglutination [TP-PA], or fluorescent treponemal antibody absorbed [FTA-ABS]).

Annotated entities:
- Temporal: "Active"
- Condition: "syphilis"
- Procedure: "treatment"
- Condition: "syphilis"
- Temporal: "within 90 days prior to study entry"
- Reference_point: "study entry"
- Temporal: "Active"
- Condition: "syphilis"
- Value: "four-fold increase"
- Measurement: "serum rapid plasma reagin (RPR)"
- Measurement: "venereal disease research laboratory (VDRL)"
- Condition: "syphilis"
- Temporal: "past"
- Value: "reactive"
- Temporal: "newly"
- Measurement: "serum RPR"
- Measurement: "VDRL"
- Procedure: "reactive confirmatory test"
- Procedure: "enzyme immunoassays [EIA]"
- Procedure: "chemiluminescent assay [CIA]"
- Procedure: "T. pallidum particle agglutination [TP-PA]"
- Procedure: "fluorescent treponemal antibody absorbed [FTA-ABS]"